Patients with an established infection (diagnostic test required) e.g. acute malaria, dengue, leptospirosis, typhoid, Japanese encephalitis etc.

The above is a clinical trial exclusion criterion. Annotated with entity spans:
Patients with an established [Condition: infection] ([Procedure: diagnostic test] required) e.g. [Condition: acute malaria], [Condition: dengue], [Condition: leptospirosis], [Condition: typhoid], [Condition: Japanese encephalitis] etc.